Diabetes or high blood sugar diagnosed by a doctor

The above is a clinical trial exclusion criterion. Annotated with entity spans:
[Condition: Diabetes] or [Condition: high blood sugar] diagnosed by a doctor